Has received locoregional therapy to liver (transcatheter chemoembolization [TACE], transcatheter embolization [TAE], hepatic arterial infusion [HAI], radiation, radioembolization, or ablation) or other site within 4 weeks prior to the first dose of study medication

The above is a clinical trial exclusion criterion. Annotated with entity spans:
Has received [Procedure: locoregional therapy] to [Qualifier: liver] ([Procedure: transcatheter chemoembolization [TACE]], [Procedure: transcatheter embolization [TAE]], [Procedure: hepatic arterial infusion [HAI]], [Procedure: radiation], [Procedure: radioembolization], or [Procedure: ablation]) or [Qualifier: other site] [Temporal: within 4 weeks prior] to the [Reference_point: first dose of study medication]